下列關於第一型人類免疫缺乏病毒（HIV-1）混合性療法（combination therapy）的敘述，何者為錯？
A. 又名 HAART（highly active antiretroviral therapy）
B. 包括反轉錄酶抑制劑（reverse transriptase inhibitors）及蛋白酶抑制劑（protease inhibitor）的組合
C. 可根除體內的 HIV-1 病毒
D. 可降低愛滋病患的死亡率及感染其他疾病的罹病率

正確答案：C. 可根除體內的 HIV-1 病毒